Clinical trial inclusion criterion:
Adequate liver function (serum total bilirubin < 2 times the upper normal limit (UNL); serum transaminases levels <3 times [<5 times for patients with liver metastasis] UNL)

Annotated entities:
- Measurement: "liver function"
- Value: "Adequate"
- Measurement: "serum total bilirubin"
- Value: "< 2 times the upper normal limit (UNL)"
- Measurement: "serum transaminases levels"
- Value: "<3 times UNL"
- Condition: "liver metastasis"
- Value: "<5 times UNL"